Clinical trial exclusion criterion:
Known or suspected serious spinal pathology and spinal implants

Annotated entities:
- Condition: "spinal pathology"
- Device: "spinal implants"
- Qualifier: "serious"
- Mood: "suspected"
- Mood: "Known"
- Mood: "Known or suspected"